大前庭腺（greater vestibular glands）位於：
A. 骨盆腔
B. 骨盆橫膈（pelvic diaphragm）
C. 會陰深隙（deep perineal pouch）
D. 會陰淺隙（superficial perineal pouch）

正確答案：D. 會陰淺隙（superficial perineal pouch）